Clinical trial inclusion criterion:
Recently diagnosed type 2 diabetic patients.

Annotated entities:
- Condition: "type 2 diabetic"
- Temporal: "Recently diagnosed"